What is the function of the DGAT1 gene product?

Diacylglycerol acyltransferase 1 (DGAT1) catalyzes the final step in the acyl-CoA-dependent triacylglycerol biosynthesis, the enzyme catalyzes a key step in lipid biosynthesis.